Are gut proteobacteria associated with inflammatory disease?

The onset of inflammatory bowel disease is associated with enteric proteobacterial infection, yet the mechanistic basis for this association is unclear.